Clinical trial exclusion criteria:
Clinically significant abnormalities of glucose metabolism
Spinal cord compression or brain metastases unless asymptomatic, treated and stable (not requiring steroids)
Evidence of severe or uncontrolled systemic diseases, including active bleeding diatheses or active infections including hepatitis B, C and Human Immunodeficiency Virus (HIV)
Evidence of clinically significant cardiac abnormalities, uncontrolled hypotension, left ventricular ejection fraction below the lower limit of normal for the site or experience of significant cardiac interventional procedures
A bad reaction to AZD5363 or any drugs similar to it in structure or class

Annotated entities:
- Qualifier: "Clinically significant"
- Condition: "abnormalities of glucose metabolism"
- Condition: "Spinal cord compression"
- Condition: "brain metastases"
- Condition: "asymptomatic"
- Negation: "unless"
- Qualifier: "treated"
- Qualifier: "stable"
- Drug: "steroids"
- Negation: "not"
- Qualifier: "uncontrolled"
- Condition: "systemic diseases"
- Qualifier: "severe"
- Condition: "active bleeding diatheses"
- Condition: "active infections"
- Condition: "hepatitis B"
- Condition: "Human Immunodeficiency Virus (HIV)"
- Condition: "hepatitis C"
- Qualifier: "clinically significant"
- Undefined_semantics: "clinically significant"
- Condition: "cardiac abnormalities"
- Condition: "uncontrolled hypotension"
- Measurement: "left ventricular ejection fraction"
- Value: "below the lower limit of normal"
- Procedure: "cardiac interventional procedures"
- Qualifier: "significant"
- Subjective_judgement: "significant"
- Condition: "bad reaction to AZD5363"
- Drug: "AZD5363"
- Context_Error: "A bad reaction to AZD5363 or any drugs similar to it in structure or class"
- Non-query-able: "A bad reaction to AZD5363 or any drugs similar to it in structure or class"